下列那一個生理變化在肺氣腫（emphysema）患者最可能顯	增加？
A. 解剖無效腔（anatomic dead space）
B. 呼吸道阻力（resistance）
C. 肺擴散容積（diffusing capacity）
D. 肺臟彈性（elasticity）

正確答案：B. 呼吸道阻力（resistance）